Which genes have been found mutated in Gray platelet syndrome patients?

The genetic defect responsible for gray platelet syndrome was recently identified in biallelic mutations in the NBEAL2 gene.
A nonsense mutation in the gene encoding the transcription factor GFI1B (growth factor independent 1B) that causes autosomal dominant gray platelet syndrome.
X-linked gray platelet syndrome due to a GATA1 Arg216Gln mutation.